Clinical trial exclusion criterion:
Severe neurological disorder leading to immobility or confined to a wheelchair

Entity relations:
- Has_qualifier("neurological disorder", "Severe")
- AND("immobility", "neurological disorder")
- OR("immobility", "wheelchair")